Clinical trial exclusion criterion:
Females who have high response (estradiol at time of ovulation trigger is > 5000 pg/ml or more than 15 oocytes are retrieved)

Entity relations:
- Has_index("at time of ovulation trigger", "ovulation trigger")
- Has_value("estradiol", "> 5000 pg/ml")
- Has_temporal("estradiol", "at time of ovulation trigger")
- Has_value("oocytes retrieved", "more than 15")
- Subsumes("high response", "estradiol")
- OR("estradiol", "oocytes retrieved")